Clinical trial exclusion criterion:
1) Refusal of epidural catheter 2) Pregnancy 3) Bleeding History 4) Inability to understand how to use the PCA device 5) Medication interfering with blood coagulation 6) Patients allergic to local anesthetics 7) Patient refusal to participate in study 8) Developmental delay

Annotated entities:
- Mood: "Refusal"
- Device: "epidural catheter"
- Condition: "Pregnancy"
- Condition: "Bleeding"
- Temporal: "History"
- Non-query-able: "Inability to understand how to use the PCA device"
- Drug: "Medication"
- Qualifier: "interfering with blood coagulation"
- Condition: "allergic"
- Drug: "local anesthetics"
- Line: "1) Refusal of epidural catheter"
- Line: "2) Pregnancy"
- Line: "3) Bleeding History"
- Line: "4) Inability to understand how to use the PCA device"
- Line: "5) Medication interfering with blood coagulation"
- Line: "6) Patients allergic to local anesthetics"
- Line: "7) Patient refusal to participate in study"
- Line: "8) Developmental delay"
- Non-query-able: "Patient refusal to participate in study"
- Condition: "Developmental delay"